Clinical trial exclusion criterion:
Pregnancy (ß-HCG blood-based assay)or nursing (lactating) women

Annotated entities:
- Pregnancy_considerations: "Pregnancy (ß-HCG blood-based assay)or nursing (lactating) women"